下列何者和調控凝血無關？
A. fibrinogen
B. protein C
C. C-reactive protein
D. kallikrein

正確答案：C. C-reactive protein